Clinical trial exclusion criterion:
4. Congenital heart disease;

Annotated entities:
- Procedure: "Congenital heart disease"